下列關於危害評估的敘述，何者錯誤？
A. 危害評估包含質性研究（Qualitative Study）與危害辨識（Hazard Identification）兩部分
B. 危害辨識之資料可經由國際間各種毒理資料庫及研究文獻之收集、查詢獲得
C. 危害辨識定義為決定某一物質是否會增加某種健康狀態的盛行率過程
D. 危害辨識主要針對毒性化學物質的固有毒性進行確認

正確答案：C. 危害辨識定義為決定某一物質是否會增加某種健康狀態的盛行率過程